Clinical trial exclusion criterion:
Are pregnant or lactating.

Annotated entities:
- Condition: "pregnant"
- Condition: "lactating"